Past participation in an HIV vaccine study

The above is a clinical trial exclusion criterion. Annotated with entity spans:
[Non-query-able: Past participation in an HIV vaccine study]